Si definimos el punto de corte para diagnosticar insuficiencia renal a través del Índice de Filtrado Glomerular (IFG) como 15 ml/min en vez de 60 ml/min está aumentando:
1. La sensibilidad del IFG.
2. La especificidad del IFG.
3. El Valor Predictivo Positivo del IFG.
4. El Valor Predictivo Negativo del IFG.
5. La Validez interna y externa del IFG.

Respuesta correcta: 2. La especificidad del IFG.